inability to understand the informed consent and demands of the study;

The above is a clinical trial exclusion criterion. Annotated with entity spans:
[Informed_consent: inability to understand the informed consent and demands of the study;]